有關語言及溝通表達上可能會遭遇的問題，下列何者錯誤？
A. 腦傷病患在溝通表達上最常見的問題和認知（cognition）不良有關
B. 語言失用症（ apraxia of speech）常常合併發生布卡氏失語症（Broca's aphasia）
C. 右腦損傷時在溝通表達上最常見的問題是語言流暢度（fluency）變差
D. 小腦（cerebellum）受損時也會造成口吃（dysarthria）

正確答案：C. 右腦損傷時在溝通表達上最常見的問題是語言流暢度（fluency）變差